Mujer, 63 años, en tratamiento por cáncer de huesos. Tiene dolores intensos por lo que utiliza morfina diariamente. Ante las quejas por estreñimiento, se plantea como laxante de elección:
1. Metilcelulosa.
2. Glicerina.
3. Loperamida.
4. Metilnaltrexona.
5. Racecadotrilo.

Respuesta correcta: 4. Metilnaltrexona.